Clinical trial inclusion criteria:
ASA I-III
Colonoscopy
Written informed consent from participating subject

Annotated entities:
- Measurement: "ASA"
- Value: "I-III"
- Procedure: "Colonoscopy"
- Informed_consent: "Written informed consent from participating subject"